El riñón corrige la disminución de presión arterial aumentando la:
1. Diuresis.
2. Reabsorción de K+.
3. Excreción de Na+.
4. Liberación de renina.

Respuesta correcta: 4. Liberación de renina.